慢性腎衰竭所造成的 secondary hyperparathyroidism 最主要的成因是：
A. Hyperphosphatemia
B. Metabolic acidosis
C. Aluminum intoxication
D. Accumulation of β2-microglobulin

正確答案：A. Hyperphosphatemia